下列抗癌藥物中，何者可以和血管內皮生長因子A（vascular endothelial growth factor-A）結合，而抑制腫瘤之血管新生（angiogenesis），達到抗癌作用？
A. bevacizumab
B. cetuximab
C. panitumumab
D. trastuzumab

正確答案：A. bevacizumab